Patients that require emergent release of a RBC transfusion and in whom emergency randomization could not be completed

The above is a clinical trial exclusion criterion. Annotated with entity spans:
Patients that [Mood: require] [Qualifier: emergent release] of a [Procedure: RBC transfusion] and in whom [Procedure: emergency randomization] [Negation: could not be completed]